Prior use of or a known allergy or hypersensitivity to pregabalin.

The above is a clinical trial exclusion criterion. Annotated with entity spans:
Prior use of or a known [Condition: allergy] or [Condition: hypersensitivity] to [Drug: pregabalin].